myopia of > or = to 8 diopters.

The above is a clinical trial exclusion criterion. Annotated with entity spans:
[Condition: myopia] of [Value: > or = to 8 diopters].